Clinical trial exclusion criterion:
Documented or suspected family or personal history of malignant hyperthermia.

Entity relations:
- OR("personal history", "history family")